Subjects were to be non-users of tobacco products (minimum of 6 months prior to the start of the study).

The above is a clinical trial inclusion criterion. Annotated with entity spans:
Subjects were to be [Negation: non]-[Condition: users of tobacco products] ([Temporal: minimum of 6 months prior to the start of the study]).